Clinical trial exclusion criterion:
patients with twin pregnancy;

Annotated entities:
- Qualifier: "twin"
- Condition: "pregnancy"